家豪對塵蟎過敏，常常在秋冬換季時出現流鼻水、打噴嚏、眼睛癢等症狀，在發作時他的免疫反應相較於正常人最可能出現下列何種現象？
A. T細胞分泌較高量的TGF-β細胞激素
B. 有明顯遲發性過敏反應（delayed type hypersensitivity）
C. 出現很高量對塵蟎具特異性的IgA
D. 活化的肥大細胞（mast cell）釋放發炎介質

正確答案：D. 活化的肥大細胞（mast cell）釋放發炎介質